Se ha comprobado que la velocidad de disolución del solvato que se forma al asociarse la griseofulvina y el cloroformo, es:
1. Menor que la de la forma no solvatada del fármaco.
2. Paso limitante de la disgregación de los comprimidos en los que se formula el fármaco.
3. Mayor que la de la forma no solvatada del fármaco.
4. Factor limitante de la distribución del fármaco a los sectores acuosos del organismo.
5. Igual a la de la forma no solvatada del fármaco.

Respuesta correcta: 3. Mayor que la de la forma no solvatada del fármaco.